用以診斷幽門桿菌（Helicobacter pylori）感染的非侵犯性（non-invasive）方法，所偵測的是該菌何種產物？
A. 觸酶（catalase）
B. 黏蛋白酶（mucinase）
C. 氧化酶（oxidase）
D. 尿素酶（urease）

正確答案：D. 尿素酶（urease）